successful left atrial appendage occlusion with Amulet device within 37 days prior to randomization.

The above is a clinical trial inclusion criterion. Annotated with entity spans:
[Qualifier: successful] [Procedure: left atrial appendage occlusion] with [Device: Amulet device] [Temporal: within 37 days prior to randomization].